¿Cuál de las siguientes opciones se refiere a características más específicas del fenómeno de flashback?:
1. Recuerdos invasivos recurrentes de lo sucedido.
2. Revivir lo sucedido con pensamientos e imágenes como si estuviese ocurriendo ahora mismo.
3. Amnesias psicógenas referidas a algún aspectos del acontecimiento traumático.
4. Reacciones fisiológicas intensas ante estímulos que recuerdan el acontecimiento traumático.

Respuesta correcta: 2. Revivir lo sucedido con pensamientos e imágenes como si estuviese ocurriendo ahora mismo.